下列何者是臍靜脈（umbilical vein）的殘跡？
A. 肝鐮韌帶（falciform ligament）
B. 肝圓韌帶（ligamentum teres）
C. 冠狀韌帶（coronary ligament）
D. 正中臍韌帶（median umbilical ligament）

正確答案：B. 肝圓韌帶（ligamentum teres）